下列疾病，何者極少由砂眼披衣菌（Chlamydia trachomatis）所引起？
A. 嬰兒肺炎（infant pneumonia）
B. 腦膜炎（meningitis）
C. 生殖道及尿道感染（urogenital infections）
D. 淋巴肉芽腫（lymphogranuloma venereum）

正確答案：B. 腦膜炎（meningitis）